Clinical trial inclusion criterion:
Women with a singleton pregnancy undergoing cesarean section after 37 weeks of gestation.

Entity relations:
- Has_value("gestation", "after 37 weeks")
- AND("cesarean section", "gestation")